Clinical trial exclusion criteria:
Preoperative use of an anticoagulant (Plavix, warfarin, lovenox, etc.)
History of hypersensitivity to EACA
History of thromboembolic event (e.g., PE or DVT)
History of renal insufficiency or failure
Congenital or acquired coagulopathy as evidence by INR >1.4 or PTT > 1.4 times normal, or Platelets <150,000/mm3 on preoperative laboratory testing
Use of hormone replacement therapy or hormonal contraceptive agents within days prior to surgery
Use of acetylsalicylic acid (ASA), antiplatelet agents within 7 days prior to surgery
Pregnant
Breastfeeding
Not received neuraxial anesthesia

Annotated entities:
- Temporal: "Preoperative"
- Drug: "anticoagulant"
- Drug: "Plavix"
- Drug: "warfarin"
- Drug: "lovenox"
- Condition: "hypersensitivity"
- Drug: "EACA"
- Condition: "thromboembolic event"
- Condition: "PE"
- Condition: "DVT"
- Condition: "renal insufficiency"
- Condition: "renal failure"
- Qualifier: "Congenital"
- Qualifier: "acquired"
- Condition: "coagulopathy"
- Measurement: "INR"
- Value: ">1.4 times normal"
- Measurement: "PTT"
- Value: "> 1.4 times normal"
- Measurement: "Platelets"
- Value: "<150,000/mm3"
- Procedure: "preoperative laboratory testing"
- Procedure: "hormone replacement therapy"
- Drug: "hormonal contraceptive agents"
- Temporal: "within days prior to surgery"
- Reference_point: "surgery"
- Drug: "acetylsalicylic acid"
- Drug: "ASA"
- Drug: "antiplatelet agents"
- Temporal: "within 7 days prior to surgery"
- Reference_point: "surgery"
- Condition: "Pregnant"
- Observation: "Breastfeeding"
- Procedure: "neuraxial anesthesia"
- Negation: "Not received"